腎衰竭病人常有出血傾向，其中最重要的機轉為：
A. 血小板數目減少
B. 血小板凝集功能不正常
C. 肝內凝血蛋白質合成減少
D. 血管完整性異常

正確答案：B. 血小板凝集功能不正常